Clinical trial exclusion criterion:
Patient who pregnant

Annotated entities:
- Condition: "pregnant"